50 歲中年女性，抽血檢查之肝生化指數如下：A/G：3.9/4.0 g/dL、Bil：1.0/0.4 mg/dL、GOT：120 U/L 、GPT：140 U/L、ALP：840 U/L、r-GT：500 U/L。各項病毒標記檢查顯示全為陰性、超音波檢查 結果正常。請問：下列敘述何者錯誤？
A. 測 AMA 有助於診斷
B. 做肝切片有助於診斷
C. 給 prednisolone 有助於治療
D. 給 ursodeoxycholic acid 有助於治療

正確答案：C. 給 prednisolone 有助於治療